Clinical trial exclusion criteria:
eGFR(Epidermal growth factor receptor) < 50mL/min
AST(aspartate aminotransferase)/ALT(alanine aminotransaminase) >2.5 upper limit of normal
Pregnant or lactating women
Subject who the investigator deems inappropriate to participate in this study
Patients with a history of bladder cancer or patients with active bladder cancer
Patients with uninvestigated macroscopic hematuria
Patients with cardiac failure or a history of cardiac failure (New York Heart Association [NYHA] Stages 3 to 4)
Patients with genetic problems such as galactose intolerance, Lapp lactase deficiency or glucose-galactose malabsorption, since this study drug contains lactose

Annotated entities:
- Measurement: "eGFR"
- Measurement: "Epidermal growth factor receptor"
- Value: "< 50mL/min"
- Measurement: "AST"
- Measurement: "aspartate aminotransferase"
- Measurement: "ALT"
- Measurement: "alanine aminotransaminase"
- Value: ">2.5 upper limit of normal"
- Pregnancy_considerations: "Pregnant or lactating women"
- Non-query-able: "Subject who the investigator deems inappropriate to participate in this study"
- Condition: "bladder cancer"
- Qualifier: "active"
- Condition: "bladder cancer"
- Condition: "macroscopic hematuria"
- Qualifier: "uninvestigated"
- Condition: "cardiac failure"
- Temporal: "history of cardiac failure"
- Measurement: "New York Heart Association Stages"
- Value: "3 to 4"
- Measurement: "NYHA"
- Condition: "genetic problems"
- Condition: "galactose intolerance"
- Condition: "Lapp lactase deficiency"
- Condition: "glucose-galactose malabsorption"